下列那一種胺基酸由於其結構的剛性（rigidity）很大，因此在蛋白質的 β－摺板（β-sheet）結構中很 少出現？
A. 甘胺酸（glycine）
B. 絲胺酸（serine）
C. 半胱胺酸（cysteine）
D. 脯胺酸（proline）

正確答案：D. 脯胺酸（proline）